Clinical trial inclusion criterion:
13. Willing to provide adequate locator information for study retention purposes and be reachable per local standard procedures

Annotated entities:
- Post-eligibility: "Willing to provide adequate locator information for study retention purposes and be reachable per local standard procedures"
- Non-query-able: "Willing to provide adequate locator information for study retention purposes and be reachable per local standard procedures"